下列何種全身性疾病較不會導致白內障？
A. 糖尿病（diabetes mellitus）
B. 高血壓（hypertension）
C. 副甲狀腺機能不足（hypoparathyroidism）
D. 異位性皮膚炎（atopic dermatitis）

正確答案：B. 高血壓（hypertension）